Clinical trial inclusion criterion:
Age 18 years or older

Annotated entities:
- Person: "Age"
- Value: "18 years or older"